Clinical trial exclusion criteria:
The patient is participating in another clinical study using an investigational product.
The patient, in the opinion of the Investigator, is unable to adhere to the requirements of the study.

Annotated entities:
- Competing_trial: "The patient is participating in another clinical study using an investigational product"
- Non-query-able: "The patient, in the opinion of the Investigator, is unable to adhere to the requirements of the study"